Females who are pregnant, breast feeding, or planning a pregnancy during the course study.

The above is a clinical trial exclusion criterion. Annotated with entity spans:
[Pregnancy_considerations: Females who are pregnant, breast feeding, or planning a pregnancy during the course study.]